Experiencing GI toxicity from MPA as determined by the treating physician within 12 months post-renal transplant

The above is a clinical trial inclusion criterion. Annotated with entity spans:
Experiencing [Procedure: GI toxicity] from [Drug: MPA] as determined by the treating physician within 12 months post-renal transplant